林先生於工作時誤觸高壓電而致電灼傷，電流自右肩入，從右手出，傷後三個月右上肢漸漸無力。 此結果最可能係肇因於下列何者組織之損傷？
A. 神經
B. 血管
C. 肌肉
D. 骨骼

正確答案：A. 神經